Clinical trial exclusion criterion:
5. Has a known adverse reaction and/or sensitivity to the study drug or its components.

Entity relations:
- OR("adverse reaction to the study drug or its components", "sensitivity to the study drug or its components")